有關減壓病（decompression sickness；DCS）之描述，何者錯誤？
A. 在海水中每下降 10 公尺，壓力增加 1 大氣壓
B. DCS 之治療除高壓氧外，亦建議補充液體
C. 鼻出血是潛水下降時，所造成之氣壓創傷（barotrauma）的症狀
D. 正常人在 3,000 公尺高度時，大氣壓力為 565 mmHg，其血氧飽合度約為 95%

正確答案：D. 正常人在 3,000 公尺高度時，大氣壓力為 565 mmHg，其血氧飽合度約為 95%